¿Cuál de los siguientes es un objetivo de los enfoques cognitivos en el tratamiento del Trastorno de Ansiedad Social (Fobia Social):
1. Incrementar, al principio las expectativas de pérdida de control sobre la propia conducta.
2. Reducir las exposiciones a situaciones temidas hasta que la ansiedad anticipatoria sea mínima.
3. Centrar la atención del sujeto en el aumento de su activación autónoma.
4. Frenar la tendencia a establecer metas perfeccionistas.

Respuesta correcta: 4. Frenar la tendencia a establecer metas perfeccionistas.